Clinical trial exclusion criterion:
Local or systemic drug use which interacts with the outcome measures.

Annotated entities:
- Qualifier: "Local"
- Qualifier: "systemic"
- Drug: "drug"
- Qualifier: "interacts with the outcome measures"